Clinical trial inclusion criterion:
1. Newly diagnosed, stage IV squamous cell lung cancer. This includes patients who present with disseminated metastases, and those with a malignant pleural or pericardial effusion (i.e., formerly stage IIIB in the 6th TNM staging system).

Annotated entities:
- Mood: "Newly diagnosed"
- Temporal: "Newly"
- Qualifier: "stage IV"
- Measurement: "stage"
- Value: "IV"
- Condition: "squamous cell lung cancer"
- Condition: "metastases"
- Qualifier: "disseminated"
- Condition: "pericardial effusion"
- Condition: "pleural effusion"
- Qualifier: "malignant"
- Measurement: "6th TNM staging system"
- Value: "stage IIIB"